Clinical trial exclusion criterion:
Immune disease

Annotated entities:
- Condition: "Immune disease"